Presence of such complications as SBP, or hepatic encephalopathy(West Haven grade = 3)

The above is a clinical trial exclusion criterion. Annotated with entity spans:
Presence of such [Condition: complications] as [Condition: SBP], or [Condition: hepatic encephalopathy]([Measurement: West Haven grade] [Value: = 3])